Clinical trial inclusion criterion:
Spinal stenosis

Annotated entities:
- Condition: "Spinal stenosis"